Known hypersensitivity to zoledronic acid or other bisphosphonates

The above is a clinical trial exclusion criterion. Annotated with entity spans:
Known [Condition: hypersensitivity] to [Drug: zoledronic acid] or [Drug: other bisphosphonates]